¿En cuál de los siguientes mecanismos de reacción se produce una inversión de la configuración desde el reactivo al producto de la reacción?:
1. Adición anti-Markovnikov.
2. Adición Markovnikov.
3. Sustitución nucleofílica bimolecular (SN2).
4. Sustitución nucleofílica unimolecular (SN1).

Respuesta correcta: 3. Sustitución nucleofílica bimolecular (SN2).